下列關於癲癇症候群（epilepsy syndromes）藥物治療的敘述，何者錯誤？
A. 青少年肌陣攣癲癇（juvenile myoclonic epilepsy）常對單一抗癲癇藥的反應良好
B. 青少年失神癲癇（juvenile absence epilepsy）常對單一抗癲癇藥的反應良好
C. Lennox-Gastaut syndrome常對單一抗癲癇藥的反應良好
D. 內側顳葉癲癇（medial temporal lobe epilepsy syndrome）常對單一抗癲癇藥的反應不佳

正確答案：C. Lennox-Gastaut syndrome常對單一抗癲癇藥的反應良好